Clinical trial inclusion criterion:
If repeat irradiation would exceed any normal tissue constraint set by MSKCC Radiation Oncology Department dose constraint criteria, the patient will potentially be eligible.

Annotated entities:
- Procedure: "repeat irradiation"
- Value: "exceed any normal tissue constraint"
- Measurement: "MSKCC Radiation Oncology Department dose constraint criteria"